Clinical trial inclusion criterion:
History of stable angina pectoris with angiographic evidence of CAD (diameter stenosis = 50%) in major, i.e., left main, left anterior descending, left circumflex, and right coronary arteries.

Annotated entities:
- Condition: "stable angina pectoris"
- Qualifier: "angiographic evidence"
- Condition: "CAD"
- Observation: "diameter stenosis"
- Multiplier: "= 50%"
- Qualifier: "right coronary arteries"
- Qualifier: "left circumflex coronary arteries"
- Qualifier: "left anterior descending coronary arteries"
- Qualifier: "left main coronary arteries"
- Non-query-able: "and"
- Qualifier: "major coronary arteries"